下列何種狀況或藥物，最不可能出現心電圖QT延長的現象？
A. 蜘蛛網膜下出血（subarachnoid hemorrhage）
B. 低血鈣症（hypocalcemia）
C. 甲狀腺亢進（hyperthyroidism）
D. amiodarone

正確答案：C. 甲狀腺亢進（hyperthyroidism）